下列何種肺癌相對其它選項較常具有表皮生長因子受體（epidermal growth factor receptor）基因的突變？
A. 腺癌
B. 狀上皮細胞癌
C. 小細胞癌
D. 大細胞癌

正確答案：A. 腺癌